下列那一個病例不符合所列之動脈血氣體分析和血清電解質的檢查結果［pH 7.49，PaO2 90 mmHg，PaCO2 43 mmHg， 0，Cl- 89（電解質的單位是mmol/L）］？
A. 甲：40歲女病人，最近半年發現高血壓；病人有時會下肢無力，血漿皮質醛固酮濃度為38 ng/dL（正常為10～25）
B. 乙：37歲女病人，患有Sjögren's syndrome，腎臟超音波發現兩側腎臟的腎盂有鈣化跡象
C. 丙：30歲男病人因急性胰臟炎住院，給予鼻胃管引流，每天約引流出3000 mL
D. 丁：22歲女病人長期服用thiazide diuretics減肥

正確答案：B. 乙：37歲女病人，患有Sjögren's syndrome，腎臟超音波發現兩側腎臟的腎盂有鈣化跡象